Clinical trial exclusion criterion:
Serum creatinine greater than 3 times ULN.

Entity relations:
- Has_value("Serum creatinine", "greater than 3 times ULN")